Clinical trial inclusion criterion:
> 18 years old

Annotated entities:
- Value: "18 years"
- Person: "old"